Clinical trial exclusion criterion:
12. Other serious illnesses (e.g., serious infections requiring antibiotics, bleeding disorders).

Annotated entities:
- Parsing_Error: "12."
- Condition: "illnesses"
- Qualifier: "serious"
- Subjective_judgement: "serious"
- Undefined_semantics: "serious"
- Condition: "infections requiring antibiotics"
- Undefined_semantics: "infections requiring antibiotics"
- Qualifier: "serious"
- Condition: "bleeding disorders"